In which chromosome are transgenes inserted in the case of the LiPS-A3S line?

Human pluripotent stem cells (hPSCs) can enable and empower a variety of studies in stem cell research, including lineage tracing and functional genetics studies. In recent years much progress has been made in the development of tools for gene targeting, little attention has been given to the identification of sites in the human genome where transgenes can be inserted and reliably expressed. The LiPS-A3S line of chromosome 15 is one of the few genes with an integration site in chromosome 15.